Clinical trial exclusion criterion:
The patient had a coronary stent for less than 12 months

Annotated entities:
- Device: "coronary stent"
- Temporal: "less than 12 months"